Gender: male or female;

The above is a clinical trial inclusion criterion. Annotated with entity spans:
[Person: Gender]: [Value: male] or [Value: female];